No more than one HIV-1 plasma RNA greater than or equal to 50 and less than 200 copies/mL (only one "blip") in the past 6 months with a subsequent HIV-1 plasma RNA less than 50 copies/mL. NOTE: There should be no plasma HIV-1 RNA greater than 200 copies/mL within the 6 months prior to study entry.

The above is a clinical trial inclusion criterion. Annotated with entity spans:
[Multiplier: No more than one] [Measurement: HIV-1 plasma RNA] [Value: greater than or equal to 50 and less than 200 copies/mL] (only one "blip") [Temporal: in the past 6 months] with a [Temporal: subsequent] [Measurement: HIV-1 plasma RNA] [Value: less than 50 copies/mL]. NOTE: There should be [Negation: no] [Measurement: plasma HIV-1 RNA] [Value: greater than 200 copies/mL] [Temporal: within the 6 months prior to study entry].